25 歲的女性病患，近三年來每天早晨總是意識不清，難以起床。並曾因懷疑自己有健忘症到精神科求診，而服用藥物治療。某天早上，家人發現她昏睡不起，緊急將她送醫。檢查發現胰島素與血糖比率（I/G）超過 1；在禁食後，病人異常精神狀況變的更加明顯。核磁共振掃描檢查以及動脈刺激肝靜脈血液採樣術（selective arterial calcium stimulation with hepatic venous sampling）發現有胰臟尾部的腫瘤，且腫瘤位置非常接近胰管。下列何者，為最可能的診斷？
A. 胃泌素瘤（gastrinoma）
B. 胰島素瘤（insulinoma）
C. 血糖激素瘤（glucagonoma）
D. 生長抑制素瘤（somatostatinoma）

正確答案：B. 胰島素瘤（insulinoma）